Patients with preexisting neuromuscular conditions (myasthenia gravis, Eaton Lambert syndrome)

The above is a clinical trial exclusion criterion. Annotated with entity spans:
Patients with preexisting [Condition: neuromuscular conditions] ([Condition: myasthenia gravis], [Condition: Eaton Lambert syndrome])